Clinical trial exclusion criterion:
Allergy to ceftriaxone or macrolides

Entity relations:
- AND("Allergy", "ceftriaxone")
- OR("ceftriaxone", "macrolides")